Clinical trial inclusion criterion:
age>18 years

Entity relations:
- Has_value("age", ">18 years")